Score greater than 8 on Children's Yale-Brown Obsessive Compulsive Scale

The above is a clinical trial inclusion criterion. Annotated with entity spans:
Score [Value: greater than 8] on [Measurement: Children's Yale-Brown Obsessive Compulsive Scale]